32歲女性突然覺得心跳很快，這是本週第二次出現，第一次出現在數分鐘之後自行停止。這次已經持續半個小時，當她到達急診時，血壓120/70毫米汞柱，呼吸每分鐘十四次，氧合濃度百分之九十八（沒有使用氧氣），心電圖出現窄波規則心率，每分鐘一百八十次。此心律不整經給予頸動脈竇按摩及Valsalva maneuver，心跳並沒有下降。接下來給予何種藥物為佳？
A. verapamil 2.5到 5 mg，一分鐘靜脈注射完畢
B. digoxin 0.5 mg，靜脈緩慢注射
C. adenosine 6 mg，靜脈快速注射
D. diltiazem 0.25 mg/kg，一分鐘靜脈注射完畢

正確答案：C. adenosine 6 mg，靜脈快速注射